Clinical trial exclusion criterion:
Clinically significant agitation /aggression for which either 1) the frequency of agitation /aggression as assessed by the NPI is 'Very frequently', or 2) the frequency of agitation /aggression as assessed by the NPI is 'Frequently' AND the severity of the agitation as assessed by the NPI is 'Moderate', or 'Marked'

Annotated entities:
- Condition: "agitation /aggression"
- Qualifier: "Clinically significant"
- Undefined_semantics: "Clinically significant"
- Multiplier: "frequency of agitation /aggression"
- Condition: "agitation /aggression"
- Measurement: "NPI"
- Value: "Very frequently"
- Multiplier: "frequency of agitation /aggression"
- Condition: "agitation /aggression"
- Measurement: "NPI"
- Value: "Frequently"
- Measurement: "NPI"
- Value: "Moderate"
- Value: "Marked"
- Qualifier: "severity of the agitation"
- Condition: "agitation"